En la sustitución electrofílica aromática con un anillo bencénico monosustituido, los halógenos son:
1. Orto/para dirigentes pero activantes.
2. Meta dirigentes pero activantes.
3. Meta/para dirigentes pero activantes.
4. Orto/meta dirigentes pero activantes.
5. Orto/para dirigentes pero desactivantes.

Respuesta correcta: 5. Orto/para dirigentes pero desactivantes.